Myastheny

The above is a clinical trial exclusion criterion. Annotated with entity spans:
[Condition: Myastheny]